11. Subjects should be either sexually inactive (abstinent) or agree to use a barrier method with spermicide in the event of sexual activity throughout the study period

The above is a clinical trial inclusion criterion. Annotated with entity spans:
11. Subjects should be either [Condition: sexually inactive] (abstinent) or [Observation: agree to use] a [Device: barrier method with spermicide] in the event of sexual activity throughout the study period